Clinical trial exclusion criterion:
Hepatic disease or biliary tract obstruction, or significant hepatic enzyme elevation (ALT or AST > 3 times upper limit of normal).

Entity relations:
- Has_qualifier("hepatic enzyme elevation", "significant")
- Has_value("ALT", "> 3 times upper limit of normal")
- AND("hepatic enzyme elevation", "ALT")
- OR("ALT", "AST")
- OR("Hepatic disease", "biliary tract obstruction", "hepatic enzyme elevation")